Liver transplant recipients who are 18-65 years of age of a primary liver transplant

The above is a clinical trial inclusion criterion. Annotated with entity spans:
[Person: Liver transplant recipients] who are [Value: 18-65 years] of [Person: age] of a [Procedure: primary liver transplant]